Which genes are the main markers of primitive Endoderm (prEN) formation?

The genes involved in primitive endoderm (prEN) formation are fgf4, lrp2, gata4, pdgfra, p dgfrα, gATA6, nanog, pDgfralpha, egam1 and dab2.